6. No Congenital,Mental and other Nervous system diseases

The above is a clinical trial inclusion criterion. Annotated with entity spans:
6. [Negation: No] [Condition: Congenital],[Condition: Mental] and other [Condition: Nervous system diseases]